plus 2 of 4:

The above is a clinical trial inclusion criterion. Annotated with entity spans:
[Non-representable: plus 2 of 4:]